Clinical trial exclusion criterion:
AST(aspartate aminotransferase)/ALT(alanine aminotransaminase) >2.5 upper limit of normal

Annotated entities:
- Measurement: "AST"
- Measurement: "aspartate aminotransferase"
- Measurement: "ALT"
- Measurement: "alanine aminotransaminase"
- Value: ">2.5 upper limit of normal"